Clinical trial inclusion criterion:
Female subjects between 16 and 40 years or women older than 40 years with a cessation of ovarian function before the age of 40 years with increased levels of FSH

Annotated entities:
- Person: "Female"
- Value: "between 16 and 40 years"
- Value: "older than 40 years"
- Person: "years"
- Person: "women"
- Reference_point: "older"
- Condition: "cessation of ovarian function"
- Value: "before the age of 40 years"
- Person: "age"
- Value: "increased"
- Measurement: "levels of FSH"